Clinical trial inclusion criterion:
eGFR at least 60 ml/mn

Entity relations:
- Has_value("eGFR", "at least 60 ml/mn")